Clinical trial exclusion criterion:
Use of steroids or drugs that interfere with the metabolism of estrogen.

Annotated entities:
- Drug: "steroids"
- Drug: "drugs that interfere with the metabolism of estrogen"